下列關於病毒與其可引起之疾病的敘述，何者錯誤？
A. 呼吸道融合病毒（Respiratory syncytial virus）可引起肺炎（pneumonia）
B. 副流行性感冒病毒（Parainfluenza virus）可引起哮喘（croup）
C. 鼻病毒（Rhinovirus）可	引	起疱	疹	性	咽	呷 炎 （herpangina）
D. 冠狀病毒（Human coronavirus）可引起感冒（common cold）

正確答案：C. 鼻病毒（Rhinovirus）可	引	起疱	疹	性	咽	呷 炎 （herpangina）